急性氣管炎合併肺部瀰漫性間質發炎，最可能是下列那一類感染引起？
A. 病毒
B. 肺炎雙球菌
C. 葡萄球菌
D. 黴菌

正確答案：A. 病毒